一位 63 歲的男性接受經尿道攝護腺切除（transurethral resection of prostate, TURP）手術治療其攝護腺肥大（BPH），術中患者發生視幻覺及語無倫次的現象。術後在恢復室中有氣促（shortness of breath）的現象，抽血檢驗發現其血中鈉離子為 120 meq/L，creatinine 為 2.7 mg/dL，尿量變少，胸部 X 光可見兩側肋膜積水。請問以下最有可能的診斷是：
A. 併發 TURP syndrome
B. 併發急性心肌梗塞
C. 併發肺栓塞
D. TURP 後尿管被血塊堵住

正確答案：A. 併發 TURP syndrome